¿Cuál de los siguientes poliedros NO da lugar a un número de coordinación ocho?:
1. Cubo.
2. Antiprisma cuadrado.
3. Dodecaedro de caras triangulares.
4. Icosaedro.

Respuesta correcta: 4. Icosaedro.